下列那一個抗憂鬱藥物抑制serotonin和norepinephrine的再回收，較沒有抗膽鹼（anticholinergic） 以及α腎上腺素阻斷（α-adrenergic blocking）的副作用？
A. amitriptyline
B. venlafaxine
C. fluoxetine
D. selegiline

正確答案：B. venlafaxine